Clinical trial exclusion criterion:
Surgical Closure of abdominal wall defect with prosthetic material (e.g. prosthetic or bio-prosthetic mesh)

Entity relations:
- AND("Surgical Closure", "abdominal wall defect")
- Subsumes("prosthetic material", "prosthetic mesh")
- AND("Surgical Closure", "prosthetic material")
- OR("prosthetic mesh", "bio-prosthetic mesh")